Clinical trial exclusion criterion:
Age < 20 or > 35 years.

Entity relations:
- Has_value("Age", "< 20")
- OR("< 20", "> 35 years")